Non-English speaking subjects

The above is a clinical trial exclusion criterion. Annotated with entity spans:
[Non-query-able: Non-English speaking subjects]